有關氣喘患者的減敏療法，何者為非？
A. 減敏療法會產生阻斷性的 IgG 抗體
B. 也建議應用在食物過敏疾病的治療
C. 可能會導致過敏原特異性的介白質-4（IL-4）降低和γ-干擾素（IFN-γ）上升
D. 不建議用在使用β-阻斷劑（β-blocker）的患者

正確答案：B. 也建議應用在食物過敏疾病的治療